19 years old and above.

The above is a clinical trial inclusion criterion. Annotated with entity spans:
[Value: 19 years] [Person: old] and above.